Clinical trial inclusion criterion:
Women of childbearing age had to use a proven method to prevent pregnancy, before the surgical treatment.

Annotated entities:
- Observation: "childbearing age"
- Person: "Women"
- Observation: "method to prevent pregnancy"
- Temporal: "before the surgical treatment"
- Reference_point: "the surgical treatment"
- Procedure: "surgical treatment"